what is the effect of Bisphenol A in the body?

Bisphenol A (BPA) is an endocrine disruptor that modulates the immune response to infections.